Clinical trial exclusion criterion:
ALT or AST >= 1.5 x ULN

Entity relations:
- Has_value("ALT", ">= 1.5 x ULN")
- OR("ALT", "AST")